Clinical trial exclusion criterion:
History of Chronic pain or ongoing treatment for chronic pain

Annotated entities:
- Temporal: "History"
- Condition: "Chronic pain"
- Condition: "chronic pain"
- Temporal: "ongoing"
- Procedure: "treatment"